Clinical trial inclusion criterion:
Stenosis of more than 50% in femoropopliteal artery

Annotated entities:
- Condition: "Stenosis"
- Value: "more than 50%"
- Qualifier: "femoropopliteal artery"